Cuál de los siguientes metabolitos es un sustrato gluconeogénico:
1. Etanol.
2. Ácido oleico.
3. Acetil-CoA.
4. NADPH+H+.
5. Glicerol.

Respuesta correcta: 5. Glicerol.